Please list the 2 vaccines for herpes zoster(shingles)

Shingrix is a recombinant adjuvant subunit vaccine.